30歲男性，長期有大量吸菸習慣，最近發現左側下肢疼痛並有間歇跛行，戒菸後明顯減少發作次數，下列何者為最有可能的診斷？
A. 顯微型多發性血管炎（microscopic polyangiitis）
B. 結節性多發性動脈炎（polyarteritis nodosa）
C. 堵塞性血栓血管炎（thromboangiitis obliterans）
D. 韋氏多發性肉芽腫（Wegener granulomatosis）

正確答案：C. 堵塞性血栓血管炎（thromboangiitis obliterans）